Clinical trial exclusion criterion:
Patients receiving contraindicated medication.

Annotated entities:
- Drug: "contraindicated medication"